Clinical trial exclusion criterion:
Patients with active systemic infection that requires the continued administration of antibiotics.

Entity relations:
- Has_qualifier("systemic infection", "active")
- AND("systemic infection", "antibiotics")
- Has_multiplier("antibiotics", "continued administration")